Clinical trial exclusion criterion:
Patients with galactose intolerance, lapp lactase deficiency or glucose-galactose malabsorption.

Entity relations:
- OR("galactose intolerance", "lapp lactase deficiency", "glucose-galactose malabsorption")